Clinical trial exclusion criterion:
Inability to provide written informed consent obtained at time of study enrollment.

Annotated entities:
- Informed_consent: "Inability to provide written informed consent obtained at time of study enrollment."